林小姐因出現頭昏、噁心、嘔吐被送至急診室，當時呼吸頻率為13次／分，體循環動脈血液分析數值分別 為：PaO2＝98 mmHg，PaCO2＝38 mmHg，SaO2＝70%，Hb＝14 g/100 mL。根據上述的結果，推測可
 能為下列何種病患之特徵？
A. 一氧化碳中毒
B. 大量失血
C. 呼吸衰竭
D. 高山症

正確答案：A. 一氧化碳中毒